Qué enunciado referente al tratamiento sustitutivo con L-tiroxina en un paciente con hipotiroidismo es correcto?
1. Se determinará la función tiroidea a las 48 horas de su inicio para valorar la eficacia.
2. En los pacientes ancianos y con el fin de mejorar la sintomatología de manera rápida, se inicia tratamiento con L-T4 a una dosis de 150-200 microgramos al día.
3. En el embarazo los requerimientos            de hormona tiroidea suelen aumentar en unos 50 microgramos al día, sobre la dosis previa.
4. Debe tomarse la medicación en medio de las comidas.
5. Conviene administrar un protector gástrico simultaneamente para evitar una gastritis.

Respuesta correcta: 3. En el embarazo los requerimientos            de hormona tiroidea suelen aumentar en unos 50 microgramos al día, sobre la dosis previa.